Clinical trial exclusion criterion:
A positive pre-study Hepatitis B surface antigen or positive Hepatitis C antibody result within 3 months of screening

Entity relations:
- Has_value("Hepatitis B surface antigen", "positive")
- Has_temporal("Hepatitis B surface antigen", "pre-study")
- Has_value("Hepatitis C antibody", "positive")
- Has_index("within 3 months of screening", "screening")
- Has_temporal("Hepatitis B surface antigen", "within 3 months of screening")
- OR("Hepatitis B surface antigen", "Hepatitis C antibody")